Clinical trial inclusion criterion:
Presentation of suicidal ideation (= 3 on MADRS suicidal thoughts domain at time of study entry or at any time during study)

Entity relations:
- Has_temporal("MADRS suicidal thoughts domain", "at time of study entry")
- Has_value("MADRS suicidal thoughts domain", "= 3")
- AND("suicidal ideation", "MADRS suicidal thoughts domain")
- OR("at time of study entry", "at any time during study")